Clinical trial exclusion criterion:
Preoperative recent history of opioid or alcohol abuse

Entity relations:
- Has_temporal("opioid abuse", "history")
- Has_temporal("opioid abuse", "recent")
- Has_temporal("opioid abuse", "Preoperative")
- OR("opioid abuse", "alcohol abuse")